Renal disease unrelated to SLE (e.g. diabetes mellitus, other glomerular or tubulointerstitial disease, renovascular disease), or transplanted kidney.

The above is a clinical trial exclusion criterion. Annotated with entity spans:
[Condition: Renal disease] [Negation: unrelated] to [Condition: SLE] (e.g. [Condition: diabetes mellitus], other [Condition: glomerular] or [Condition: tubulointerstitial disease], [Condition: renovascular disease]), or [Procedure: transplanted kidney].